Current substance use disorder according to the Diagnostic and Statistical Manual of Mental Disorders Fifth Edition (DSM 5)

The above is a clinical trial exclusion criterion. Annotated with entity spans:
Current [Condition: substance use disorder] according to the [Qualifier: Diagnostic and Statistical Manual of Mental Disorders Fifth Edition (DSM 5)]